Clinical trial exclusion criterion:
Exclusions Based on Laboratory Values

Annotated entities:
- Parsing_Error: "Exclusions Based on Laboratory Values"